Clinical trial exclusion criterion:
Use of blood products within 12 months before the vaccination;

Annotated entities:
- Drug: "blood products"
- Temporal: "within 12 months before the vaccination"
- Reference_point: "the vaccination"